Clinical trial exclusion criterion:
Subjects were not to have a history of alcohol or drug abuse within 2 years prior to the study (subjects with a history of previous use of cannabis were not excluded unless they had used cannabis or cannabinoid based medicine within 30 days prior to study drug administration or were unwilling to abstain for the duration of the study).

Entity relations:
- Has_index("within 2 years prior to the study", "the study")
- Has_temporal("alcohol abuse", "within 2 years prior to the study")
- Has_temporal("alcohol abuse", "history")
- Has_negation("alcohol abuse", "not")
- OR("alcohol abuse", "drug abuse")